Clinical trial exclusion criterion:
Involvement of sclera at presentation

Annotated entities:
- Condition: "Involvement of sclera"